會感染人體的致病性微生物種類繁多，但是只有少數被證明與癌症致病機轉有關。下列那一種細胞內感染的微生物有較強的證據會引起人類的癌症？
A. 腸病毒七十一型
B. EB病毒（Epstein-Barr virus）
C. 鏈球菌
D. 結核分支桿菌

正確答案：B. EB病毒（Epstein-Barr virus）